Person who weighs more than 136kg.

The above is a clinical trial exclusion criterion. Annotated with entity spans:
Person who [Person: weighs] [Value: more than 136kg].